Clinical trial exclusion criterion:
History of head injury or stroke,

Entity relations:
- Has_temporal("head injury", "History of")
- Has_temporal("stroke", "History of")
- OR("head injury", "stroke")